Known hypersensitivity to Brilliant Blue FCF (E133)

The above is a clinical trial exclusion criterion. Annotated with entity spans:
Known [Condition: hypersensitivity] to [Drug: Brilliant Blue FCF (E133)]